Clinical trial exclusion criterion:
Patient has received a liver transplant from a decrease donor > 70 years of age

Entity relations:
- Has_value("age", "> 70 years")